Treatment with class I or III antiarrhythmic drugs

The above is a clinical trial exclusion criterion. Annotated with entity spans:
Treatment with [Qualifier: class I] or III [Drug: antiarrhythmic drugs]